當戒菸治療的取代療法（replacement therapy）失	，可以考慮下列那一種藥物？
A. trazodone
B. bupropion
C. citalopram
D. venlafaxine

正確答案：B. bupropion